一位 23 歲靜脈注射毒品患者，最近出現發燒、呼吸困難及急性心臟衰竭。下列何者是這位患者急性心臟衰竭最可能的原因？
A. mitral valve prolapse with rupture of chordae tendineae
B. left ventricular aneurysm
C. aortitis with dilation of aortic ring
D. infective endocarditis with rupture of tricuspid valve

正確答案：D. infective endocarditis with rupture of tricuspid valve